誘發胚胎先天畸形的敏感時期是在受精後：
A. 第 1-2 週
B. 第 3-8 週
C. 第 9-12 週
D. 第 13-16 週

正確答案：B. 第 3-8 週